Clinical trial exclusion criterion:
pregnant or breastfeeding

Annotated entities:
- Condition: "pregnant"
- Observation: "breastfeeding"